En un paciente de 14 años con Síndrome de Down que presenta nucalgias (exploración neurológica normal) y va a ser sometido a anestesia general (intubación orotraqueal) para cirugía abdominal electiva debe descartarse:
1. Inestabilidad atloaxoidea.
2. Fístulas traqueoesofágicas.
3. Tumor cerebral.
4. Hiperplasia de cuerdas vocales.
5. Hidrocefalia.

Respuesta correcta: 1. Inestabilidad atloaxoidea.